患有細菌性腦膜炎之病人經腰椎穿刺取得腦脊髓液，再經由革蘭氏染色檢查，顯微鏡下觀察到有許多革蘭氏陰性雙球菌，則病人最有可能受到何種細菌的感染？
A. 奈氏腦膜炎雙球菌
B. 金黃色葡萄球菌
C. 肺炎球菌
D. 腸球菌

正確答案：A. 奈氏腦膜炎雙球菌